Clinical trial exclusion criterion:
Death imminent

Annotated entities:
- Condition: "Death"
- Temporal: "imminent"